受重金屬污染的土壤，不適合使用那個整治技術？
A. 蒸氣萃取法
B. 氧化還原法
C. 土壤淋洗法
D. 生物處理法

正確答案：A. 蒸氣萃取法